De los siguientes, ¿cuál se considera en la actualidad el aspecto más importante en la evaluación del abdomen agudo?
1. Realización de una anamnesis completa        y exploración física minuciosa.
2. Valoración del hemograma, especialmente      el recuento y fórmula leucocitarios.
3. Valoración de los resultados obtenidos en    la ecografía de abdomen.
4. Valoración de los resultados obtenidos en    la TC abdominal.

Respuesta correcta: 1. Realización de una anamnesis completa        y exploración física minuciosa.